在病情穩定的慢性病治療醫病關係中，下列何者是最合適的醫病互動模式？
A. 權威引導模式
B. 獨立決策模式
C. 主動參與模式
D. 指導合作模式

正確答案：C. 主動參與模式